Clinical trial exclusion criteria:
Fasting plasma glucose > 7,0 mM, HbA1c > 48 mmol/mol 3 months after RYGB.
Dysregulated thyroid diseases, use of antithyroid treatment.
Late diabetic complications as retinopathy, renal insufficiency, neuropathy or previous pancreatitis.
Complications to RYGB. Documented reactive hypoglycaemia, severe dumping (vomiting, diarrhea, severe abdominal pain after food intake).
Cholecystectomy

Annotated entities:
- Measurement: "Fasting plasma glucose"
- Value: "> 7,0 mM"
- Measurement: "HbA1c"
- Value: "> 48 mmol/mol"
- Temporal: "3 months after RYGB"
- Procedure: "RYGB"
- Reference_point: "RYGB"
- Qualifier: "Dysregulated"
- Condition: "thyroid diseases"
- Procedure: "antithyroid treatment"
- Condition: "Late diabetic complications"
- Condition: "retinopathy"
- Condition: "renal insufficiency"
- Condition: "neuropathy"
- Condition: "pancreatitis"
- Temporal: "previous"
- Condition: "Complications"
- Procedure: "RYGB"
- Condition: "reactive hypoglycaemia"
- Qualifier: "severe"
- Condition: "dumping"
- Condition: "vomiting"
- Condition: "diarrhea"
- Qualifier: "severe"
- Condition: "abdominal pain"
- Temporal: "after food intake"
- Reference_point: "food intake"
- Procedure: "Cholecystectomy"